Stable motor recovery

The above is a clinical trial inclusion criterion. Annotated with entity spans:
[Qualifier: Stable] [Observation: motor recovery]